Clinical trial exclusion criterion:
dysphagia

Annotated entities:
- Condition: "dysphagia"